Clinical trial exclusion criterion:
any confirmed or suspected immunodeficiency condition, including human immunodeficiency virus (HIV) infection, haematological malignancy, or a congenital immunodeficiency

Annotated entities:
- Condition: "immunodeficiency condition"
- Qualifier: "suspected"
- Qualifier: "confirmed"
- Condition: "human immunodeficiency virus infection"
- Condition: "HIV"
- Condition: "haematological malignancy"
- Condition: "congenital immunodeficiency"